Clinical trial inclusion criterion:
Minimum posterior disc height of 5mm at the index level(s).

Annotated entities:
- Measurement: "posterior disc height"
- Value: "Minimum of 5mm"
- Qualifier: "index level(s)"